Clinical trial exclusion criterion:
Patients with serious complications (e.g., infection, hepatic encephalopathy, hepatorenal syndrome, gastrointestinal bleeding.)

Entity relations:
- Has_qualifier("complications", "serious")
- Subsumes("complications", "infection")
- OR("infection", "hepatorenal syndrome", "hepatic encephalopathy", "gastrointestinal bleeding")